Clinical trial inclusion criterion:
Symptoms present more than six months

Annotated entities:
- Temporal: "more than six months"
- Condition: "Symptoms"